Blood disorders or coagulopathy.

The above is a clinical trial exclusion criterion. Annotated with entity spans:
[Condition: Blood disorders] or [Condition: coagulopathy].